Metabolic or hormonal abnormalities

The above is a clinical trial exclusion criterion. Annotated with entity spans:
[Condition: Metabolic] or [Condition: hormonal abnormalities]